多囊性卵巢症候群（PCOS）與下列何者疾病最無關？
A. 子宮頸鱗狀上皮癌
B. 子宮內膜癌
C. 乳癌
D. 卵巢癌

正確答案：A. 子宮頸鱗狀上皮癌